Clinical trial inclusion criterion:
previous treatment with diuretics

Annotated entities:
- Procedure: "treatment"
- Temporal: "previous"
- Drug: "diuretics"